Clinical trial exclusion criterion:
6. Incomplete colonoscopy due to causes except poor bowel preparation

Entity relations:
- Has_negation("poor bowel preparation", "except")
- Has_qualifier("colonoscopy", "Incomplete")
- AND("colonoscopy", "poor bowel preparation")